Severe dyspnea at rest because of complications of advanced malignancy or requiring current continuous oxygen therapy.

The above is a clinical trial exclusion criterion. Annotated with entity spans:
[Qualifier: Severe] [Condition: dyspnea] at rest because of [Condition: complications] of [Condition: advanced malignancy] or [Qualifier: requiring current continuous oxygen therapy].